一位50歲男性，過去並無特殊病史，突然發生癲癇大發作5分鐘，送入急診時又發作一次約3分鐘，現已停 止，目前意識不清楚，下列何者為不適當的處置？
A. 維持呼吸道暢通
B. 安排頭部電腦斷層掃描
C. 給予phenytoin治療
D. 給予benzodiazepine治療

正確答案：D. 給予benzodiazepine治療